Clinical trial inclusion criteria:
18 years or older
Type 1 or 2 diabetes
PDR patients requiring surgical intervention for complications of vitreous hemorrhage or traction retinal detachment and pre-operative IVC treatment.
women postmenopausal for 12 months before the study, surgically sterile, or not pregnant and on effective contraception.

Annotated entities:
- Value: "18 years or older"
- Person: "older"
- Condition: "Type 1 diabetes"
- Condition: "Type 2 diabetes"
- Condition: "PDR"
- Procedure: "surgical intervention"
- Mood: "requiring"
- Condition: "vitreous hemorrhage"
- Condition: "traction retinal detachment"
- Qualifier: "pre-operative"
- Procedure: "IVC treatment"
- Pregnancy_considerations: "women postmenopausal for 12 months before the study, surgically sterile, or not pregnant and on effective contraception."